一位 25 歲病人，軀幹及四肢皮膚有許多紅棕色腫瘤，經皮膚切片病理診斷為神經纖維瘤（neurofibroma）。 進一步診查也發現軀幹有許多大於 1.5 公分之咖啡牛奶斑（café-au-lait spots），腋下有 freckles，虹
 膜（iris）有數個 Lisch nodules。病人父親也有相同病徵。有關此病的敘述，下列何者錯誤？
A. 此為第一型神經纖維瘤（neurofibromatosis type 1）
B. Lisch nodules 一定會影響視力
C. 咖啡牛奶斑常是第一個出現的皮膚表徵
D. 神經纖維瘤通常於青春期後逐漸出現

正確答案：B. Lisch nodules 一定會影響視力